¿Qué factores causales tienen una especial relevancia en la anorgasmia femenina?:
1. Los factores hereditarios.
2. Los factores psicológicos.
3. Los factores orgánicos.
4. Los factores ambientales.
5. El consumo de sustancias.

Respuesta correcta: 2. Los factores psicológicos.